下列那種細胞漿性酵素對防老化有所幫助？
A. 磷脂（phospholipase）
B. 核酸內切（endonuclease）
C. 蛋白質酵素（protease）
D. 麩胺基過氧化（glutathione peroxidase）

正確答案：D. 麩胺基過氧化（glutathione peroxidase）